Clinical trial exclusion criterion:
-Currently active or previously active inflammatory bowel disease during the 12 months prior to Visit 1 Currently active gastritis, duodenal or gastric ulcers, or gastrointestinal/rectal bleeding during the 3 months prior to Visit 1.

Annotated entities:
- Condition: "inflammatory bowel disease"
- Temporal: "during the 12 months prior"
- Temporal: "Currently active"
- Temporal: "Currently active"
- Temporal: "previously active"
- Condition: "gastritis"
- Condition: "duodenal"
- Condition: "gastric ulcers"
- Condition: "gastrointestinal bleeding"
- Condition: "rectal bleeding"
- Temporal: "during the 3 months prior"